Clinical trial exclusion criterion:
Use of loop diuretics.

Annotated entities:
- Drug: "loop diuretics"